Clinical trial inclusion criterion:
6. CD4 cell counts >150 cells/μL (though likely most, if not all, will be >250 cells/μL).

Annotated entities:
- Measurement: "CD4 cell counts"
- Value: ">150 cells/μL"
- Value: ">250 cells/μL"